Diagnosed with cutaneous vasculitis, urticaria, psoriasis, acne, bullous skin diseases, sterile pustulosis, leprosy, pneumocystis pneumonia and any other patients who need dapsone administration.

The above is a clinical trial inclusion criterion. Annotated with entity spans:
Diagnosed with [Condition: cutaneous vasculitis], [Condition: urticaria], [Condition: psoriasis], [Condition: acne], [Condition: bullous skin diseases], [Condition: sterile pustulosis], [Condition: leprosy], [Condition: pneumocystis pneumonia] and any other patients who need [Drug: dapsone] administration.